have a diagnosis of locally advanced or metastatic melanoma

The above is a clinical trial inclusion criterion. Annotated with entity spans:
have a diagnosis of [Qualifier: locally advanced] or [Qualifier: metastatic] [Condition: melanoma]